> 18 years old

The above is a clinical trial inclusion criterion. Annotated with entity spans:
> [Value: 18 years] [Person: old]